Active or past psychotic disorder, including a history of psychotic affective state

The above is a clinical trial exclusion criterion. Annotated with entity spans:
[Temporal: Active] or [Temporal: past] [Condition: psychotic disorder], including a history of [Condition: psychotic affective state]